有關病毒與其細胞受器（cell receptor）的配對，下列何者錯誤？
A. EB病毒（Epstein-Barr virus）- CD21
B. 流感病毒（Influenza virus）-  水楊酸（sialic acid）
C. B19病毒（B19 virus） -  紅血球M抗原（erythrocyte M antigen）
D. 鼻病毒（Rhinovirus）- ICAM-1

正確答案：C. B19病毒（B19 virus） -  紅血球M抗原（erythrocyte M antigen）